Age>18 years.

The above is a clinical trial inclusion criterion. Annotated with entity spans:
[Person: Age][Value: >18 years.]